下列何種（enzyme）在心肌梗塞發生時不會上升？
A. creatine kinase（CK）
B. creatine kinase MB form（CK-MB）
C. glutamic oxaloacetic transaminase（GOT）
D. glutamic pyruvic transaminase（GPT）

正確答案：D. glutamic pyruvic transaminase（GPT）